Clinical trial exclusion criterion:
contraindication for any medication or substance used in survey protocol

Annotated entities:
- Condition: "contraindication"
- Drug: "medication used in survey protocol"
- Drug: "substance used in survey protocol"